王先生因大便習慣改變而接受大腸鏡檢查。檢查當天剛巧有三名醫學生到內視鏡室見習，觀看王先生接受檢查的全部過程。事後王先生向醫院投訴在檢查中沒有受到尊重，希望醫院儘速改善並給一個交代。為避免再度引起同樣的情況，醫院擬採取下列措施，其中何者最為恰當？
A. 通知醫學院請其修改見習課程，停止安排醫學生到內視鏡室見習
B. 改裝檢查室的設計，讓見習學生透過單向玻璃來觀看檢查，減少對受檢者的干擾
C. 在門診處張貼或住院需知上加註「本院為教學醫院請同意學生見實習」等文字
D. 規定除檢查工作人員外，其他人員若要進入檢查室，均應先向受檢者說明理由並徵得同意

正確答案：D. 規定除檢查工作人員外，其他人員若要進入檢查室，均應先向受檢者說明理由並徵得同意